Clinical trial exclusion criterion:
Positive Hepatitis B surface antigen test

Annotated entities:
- Value: "Positive"
- Measurement: "Hepatitis B surface antigen test"